15. Idiopathic epilepsy and anti-epileptic treatment.

The above is a clinical trial exclusion criterion. Annotated with entity spans:
[Parsing_Error: 15.] [Condition: Idiopathic epilepsy] and [Condition: anti-epileptic treatment].